Clinical trial exclusion criterion:
prostatic hypertrophy, stroke, or ulcer in past year

Annotated entities:
- Condition: "prostatic hypertrophy"
- Condition: "stroke"
- Condition: "ulcer"